關於自殺企圖（suicide attempt）之相關敘述，下列何者正確？
A. 自殺企圖者當中，男性較女性為多
B. 評估自殺企圖患者時，為避免促進患者重複自殺行為，問句應迂迴，不宜直接訊問其目前之自殺意念或相  	關計劃
C. 邊緣性人格疾患者（borderline personality disorder）常出現具操縱意味的自殺企圖
D. 自殺企圖者中，絕大多數沒有精神科相關診斷

正確答案：C. 邊緣性人格疾患者（borderline personality disorder）常出現具操縱意味的自殺企圖